Clinical trial inclusion criterion:
Target lesion length =150 mm by angiographic estimation

Entity relations:
- Has_value("length", "=150 mm")
- AND("=150 mm", "angiographic")
- AND("Target lesion", "length")